¿Qué afirmación es verdadera en relación con el Modelo de la Repulsión de los Electrones de la capa de Valencia aplicado a moléculas AB n:
1. Las moléculas AB2 son siempre lineales.
2. Las moléculas AB6 son siempre octaédricas.
3. Las moléculas AB3 son siempre triangulares.
4. Las moléculas AB4 son siempre tetraédricas.
5. Las moléculas AB5 son siempre bipiramidal trigonales.

Respuesta correcta: 2. Las moléculas AB6 son siempre octaédricas.